Which is the main difference in the roles of Otx2 and Nanog during development?

There is a mutual antagonism between NANOG and OTX2 underlying cell fate decisions during neural patterning, critical for the regulation of early neural development in humans. Through mutual antagonism, NANOG and OTX2 specify the heterogeneous identity of ESCs and individually predispose them for optimal response to naive or primed inducing factors. More specifically OTX2 impedes self-renewal of  iPS cells through downregulation of NANOG expression.